The study patient provides informed consent and agrees to comply with all required post-procedure follow-up visits, including annual visits up to 5 years.

The above is a clinical trial inclusion criterion. Annotated with entity spans:
[Post-eligibility: The study patient provides informed consent and agrees to comply with all required post-procedure follow-up visits, including annual visits up to 5 years.]